Clinical trial inclusion criterion:
able to provide informed consent

Annotated entities:
- Informed_consent: "able to provide informed consent"